心室肌肉之細胞膜動作電位出現一段高原期（plateau），主要是細胞膜上的離子流動產生何種變化？
A. 鈉離子流入與鉀離子流出
B. 鈣離子流入與鉀離子流出
C. 鉀離子流入與鈉離子流出
D. 鉀離子流入與鈣離子流出

正確答案：B. 鈣離子流入與鉀離子流出